Clinical trial inclusion criterion:
Subacute and chronic atopic subjects who have atopic dermatitis symptoms continually at least 6 months

Annotated entities:
- Condition: "dermatitis symptoms"
- Temporal: "continually at least 6 months"
- Grammar_Error: "and"
- Qualifier: "chronic"
- Qualifier: "Subacute"